下列何者之膝部疼痛，最可能是歐氏病（Osgood-Schlatter disease）所引起？
A. 15歲男性排球選手
B. 20歲女性芭蕾舞者
C. 15歲女性游泳選手
D. 20歲男性自由車選手

正確答案：A. 15歲男性排球選手